一位 45 歲病人主訴有畏光、紅眼、視力減退，且眼角膜在細隙燈下檢查，發現有可以螢光染色 （fluorescein stain）顯示出的樹枝狀角膜潰瘍（dendritic ulcer）。他最可能患有什麼疾病？
A. 細菌性角膜炎
B. 黴菌性角膜炎
C. 寄生蟲性角膜炎
D. 疱疹病毒性角膜炎

正確答案：D. 疱疹病毒性角膜炎